What is the function of the SSX proteins?

The SYT protein appears to act as a transcriptional co-activator and the SSX proteins as co-repressors. Taken together, these results led us to conclude that the SSX moiety, especially the most C-terminal 34 amino acids, of the SYT-SSX fusion proteins is crucial for aberrant spatial targeting and transcriptional control within the nucleus. The synovial-sarcoma-associated SS18-SSX2 fusion protein induces epigenetic gene (de)regulation.